Endometrial thickness = 7 mm after stimulation

The above is a clinical trial inclusion criterion. Annotated with entity spans:
[Measurement: Endometrial thickness] [Value: = 7 mm] [Temporal: after stimulation]